下列何者為最常見造成異卵雙胞（dizygotic twins）的原因？
A. 高齡產婦（advanced maternal age）
B. 人工生殖技術（assisted reproductive technology）
C. 多產次的婦女（high parity）
D. 種族（racial predisposition）

正確答案：B. 人工生殖技術（assisted reproductive technology）